Perforated corneal ulcer

The above is a clinical trial exclusion criterion. Annotated with entity spans:
[Qualifier: Perforated] [Condition: corneal ulcer]